How many times is CLAST faster than BLAST?

clast was capable of identifying sequence similarities ~80.8 times faster than blast and 9.6 times faster than blat.